Clinical trial exclusion criterion:
High myopia in the study eye, with a spherical equivalent of >8.00D at screening

Annotated entities:
- Condition: "High myopia"
- Qualifier: "in the study eye"
- Measurement: "spherical equivalent"
- Value: ">8.00D"
- Temporal: "at screening"